Clinical trial exclusion criterion:
Moderate or severe valvular disease.

Entity relations:
- Has_qualifier("valvular disease", "Moderate")
- OR("Moderate", "severe")